peridevice leak >5mm on transesophageal echocardiography study preceding enrollment

The above is a clinical trial exclusion criterion. Annotated with entity spans:
[Measurement: peridevice leak] [Value: >5mm] on [Procedure: transesophageal echocardiography study] preceding enrollment